Clinical trial inclusion criterion:
WHO (World Health organization) Performance status: 0, 1 or 2

Entity relations:
- Has_value("WHO (World Health organization) Performance status", "0, 1 or 2")